Clinical trial inclusion criterion:
Cephalic presentation

Annotated entities:
- Observation: "Cephalic presentation"